Clinical trial inclusion criterion:
Healthy men and women, age 40-75 yrs, without any disease and need of medication.

Annotated entities:
- Observation: "Healthy"
- Person: "men"
- Person: "women"
- Person: "age"
- Value: "40-75 yrs"
- Negation: "without"
- Condition: "any disease"
- Mood: "need of"
- Drug: "medication"